Are pregnant or lactating.

The above is a clinical trial exclusion criterion. Annotated with entity spans:
Are [Condition: pregnant] or [Condition: lactating].